6. If a woman of childbearing potential, have a negative urine pregnancy test at Visit 1 and be using an adequate method of birth control throughout the study period.

The above is a clinical trial inclusion criterion. Annotated with entity spans:
[Parsing_Error: 6.] If a [Person: woman] of [Condition: childbearing potential], have a [Value: negative] [Measurement: urine pregnancy test] [Temporal: at Visit 1] and be using an [Qualifier: adequate] [Device: method of birth control] [Temporal: throughout the study period].